Clinical trial exclusion criterion:
Known risk factors for, or presence of, a cardiovascular disease

Entity relations:
- OR("risk factors cardiovascular disease", "cardiovascular disease")